Clinical trial inclusion criterion:
High-risk for VTE

Annotated entities:
- Mood: "High-risk"
- Condition: "VTE"